Kidney, parathyroid, congenital bone metabolic disease

The above is a clinical trial exclusion criterion. Annotated with entity spans:
[Qualifier: Kidney], [Qualifier: parathyroid], [Qualifier: congenital] [Qualifier: bone] [Qualifier: metabolic] [Condition: disease]